下列何者不是腦傷（traumatic brain injury）病人常見的後遺症？
A. 肌肉痙攣（spasticity）
B. 帕金森氏症（Parkinsonism）
C. 癲癇（epilepsy）
D. 頭痛（headache）

正確答案：B. 帕金森氏症（Parkinsonism）